下列何者可拮抗plasminogen活化成plasmin？
A. urokiase
B. vasopressin
C. tPA（tissue plasminogen activator）
D. tranexamic acid

正確答案：D. tranexamic acid